Clinical trial exclusion criterion:
acute lower extremity ischemic event secondary to thromboembolic disease or acute trauma,

Entity relations:
- Has_qualifier("ischemic event", "lower extremity")
- Has_qualifier("ischemic event", "acute")
- multi("secondary to acute trauma", "acute trauma")
- multi("secondary to thromboembolic disease", "thromboembolic disease")
- Has_qualifier("ischemic event", "secondary to thromboembolic disease")
- OR("secondary to thromboembolic disease", "secondary to acute trauma")